Clinical trial exclusion criterion:
Hypersensitivity to spironolactone, chlorthalidone, amlodipine, human recombinant insulin or Definity

Entity relations:
- AND("Hypersensitivity", "spironolactone")
- OR("spironolactone", "chlorthalidone", "amlodipine", "human recombinant insulin")